Clinical trial exclusion criterion:
Serious cardiac dysfunction, hypertension, or hematological disorder.

Entity relations:
- Has_qualifier("cardiac dysfunction", "Serious")
- OR("cardiac dysfunction", "hypertension", "hematological disorder")